evidence of psycological problem that may affect the capacity to understand the project and to comply with the medical recommandations

The above is a clinical trial exclusion criterion. Annotated with entity spans:
[Non-query-able: evidence of psycological problem that may affect the capacity to understand the project and to comply with the medical recommandations]